Clinical trial exclusion criterion:
8. Creatine kinase above ULN

Entity relations:
- Has_value("Creatine kinase", "above ULN")